Clinical trial inclusion criterion:
Esophagectomy

Annotated entities:
- Procedure: "Esophagectomy"